低蛋白血症（hypoproteinemia）最常發生於感染下列何種寄生蟲的病患？
A. 廣東住血線蟲（Angiostrongylus cantonensis）
B. 菲律賓毛線蟲（Capillaria philippinensis）
C. 旋毛蟲（Trichinella spiralis）
D. 犬蛔蟲（Toxocara canis）

正確答案：B. 菲律賓毛線蟲（Capillaria philippinensis）